Clinical trial inclusion criterion:
Able to consent, fill out study documents, and complete all study procedures and follow-up visits

Annotated entities:
- Post-eligibility: "Able to consent, fill out study documents, and complete all study procedures and follow-up visits"